Clinical trial inclusion criterion:
Expected duration of hospital stay and time on steroids >= 3 days

Annotated entities:
- Measurement: "Expected duration of hospital stay"
- Measurement: "time on steroids"
- Value: ">= 3 days"